Clinical trial exclusion criterion:
Patients who have received an investigational drug within 30 days prior to the current agitation episode must be excluded.

Annotated entities:
- Competing_trial: "Patients who have received an investigational drug within 30 days prior to the current agitation episode must be excluded"